一位36歲男性，在車禍中造成頸部疼痛及雙側四肢無力、感覺異常，電腦斷層影像檢查之軸向影像（axial images）顯示在第六、七頸椎處出現雙腔影像（double-lumen sign）。依照此檢查結果，下列何者是第六、七 頸椎的最適當診斷？
A. 壓迫性骨折（compression fracture）
B. 爆裂性骨折（burst fracture）
C. 小面關節骨折（facet fracture）
D. 脫位（dislocation）

正確答案：D. 脫位（dislocation）